What membrane proteins constitute TAM family of receptor tyrosine kinases (RTKs)?

Tyro3, Axl, and Mer are integral membrane proteins that constitute TAM family of receptor tyrosine kinases (RTKs).